Clinical trial inclusion criterion:
The presence of a solid, malignant tumour, excluding lymphoma, that is resistance to standard therapies or for which no standard therapies exist

Entity relations:
- Has_negation("lymphoma", "excluding")
- Has_qualifier("solid, malignant tumour", "resistance to standard therapies")
- AND("solid, malignant tumour", "lymphoma")
- OR("resistance to standard therapies", "for which no standard therapies exist")